Clinical trial exclusion criterion:
Exclusion Criteria: coronary artery disease, diabetes mellitus, contraindications to cardiac magnetic resonance imaging (CMR), weight >350 lbs, inability to lie flat for imaging, anemia, contraindications to regadenoson or aminophylline

Annotated entities:
- Condition: "coronary artery disease"
- Condition: "diabetes mellitus"
- Condition: "contraindications"
- Procedure: "cardiac magnetic resonance imaging (CMR)"
- Measurement: "weight"
- Value: ">350 lbs"
- Observation: "inability to lie flat for imaging"
- Condition: "anemia"
- Condition: "contraindications"
- Drug: "regadenoson"
- Drug: "aminophylline"